Clinical trial inclusion criterion:
4. Subject and/or guardian must be able to comply with the study protocol.

Annotated entities:
- Non-query-able: "Subject and/or guardian must be able to comply with the study protocol."
- Post-eligibility: "Subject and/or guardian must be able to comply with the study protocol."